Clinical trial exclusion criterion:
pregnancy or planning to become pregnant in the next 2 years,

Annotated entities:
- Condition: "pregnancy"
- Mood: "planning to become"
- Condition: "pregnant"
- Temporal: "in the next 2 years"